Clinical trial exclusion criterion:
Any contra-indication to liver transplantation per center protocol

Annotated entities:
- Condition: "contra-indication"
- Procedure: "liver transplantation"